Clinical trial inclusion criterion:
Subject and parent/legally acceptable representative (if applicable) able to attend all scheduled visits and to comply with all trial procedures.

Annotated entities:
- Non-query-able: "Subject and parent/legally acceptable representative (if applicable) able to attend all scheduled visits and to comply with all trial procedures."
- Post-eligibility: "Subject and parent/legally acceptable representative (if applicable) able to attend all scheduled visits and to comply with all trial procedures."